Clinical trial exclusion criterion:
History of colonic mucosal dysplasia or adenomatous colonic polyps that were not removed

Annotated entities:
- Condition: "colonic mucosal dysplasia"
- Condition: "adenomatous colonic polyps"
- Procedure: "removed"
- Negation: "not"